下列有關真性多血症（polycythemia vera）的敘述，何者正確？
A. 血漿中紅血球生成素（erythropoietin）升高
B. 病人容易發生動脈栓塞，但很少有靜脈栓塞
C. 血小板功能多正常，因此很少有出血的症狀
D. 對大多數病人，放血是最適當的治療方法

正確答案：D. 對大多數病人，放血是最適當的治療方法